Clinical trial exclusion criterion:
history of hypertension

Annotated entities:
- Condition: "hypertension"
- Temporal: "history"